Colonization confirmed by our microbiology department, including at least 3 positives swabs in the last month

The above is a clinical trial inclusion criterion. Annotated with entity spans:
[Condition: Colonization] [Qualifier: confirmed by our microbiology department], including [Multiplier: at least 3] [Value: positives] [Procedure: swabs] [Temporal: in the last mont]h